Clinical trial exclusion criterion:
medical thoracoscopy cannot be performed within 48 hours;

Entity relations:
- Has_temporal("medical thoracoscopy", "within 48 hours")
- Has_mood("medical thoracoscopy", "cannot be performed")
- multi("cannot be performed", "cannot")